Clinical trial inclusion criterion:
Adequate renal function: Creatinine clearance <1.5 times ULN concurrent with creatinine clearance >50 ml/min.

Annotated entities:
- Measurement: "Creatinine clearance"
- Value: "<1.5 times ULN"
- Temporal: "concurrent"
- Measurement: "creatinine clearance"
- Value: ">50 ml/min"
- Measurement: "renal function"
- Value: "Adequate"